Clinical trial exclusion criterion:
Subject has indeterminate, ulcerative, antibiotic-associated colitis.

Entity relations:
- Has_context("colitis", "antibiotic-associated")
- Has_context("colitis", "ulcerative")
- Has_context("colitis", "indeterminate")